Clinical trial inclusion criterion:
Age between 18 and 80 years.

Entity relations:
- Has_value("Age", "between 18 and 80 years")